Clinical trial exclusion criterion:
Aged under 18,

Entity relations:
- Has_value("Aged", "under 18")